一位 20 歲女性，在網路上購買了一瓶有去角質功能的乳液，宣稱每日塗抹於臉部，可達到美白與讓皮膚光滑的效果，下列對角質層的敘述，何者錯誤？
A. 角質層位於皮膚的最外層，正常皮膚有自然脫落的機制
B. 角質層的細胞沒有細胞核
C. 角質層已不具功能，清除角質可美化皮膚
D. 角質層細胞間隙含保溼的成分

正確答案：C. 角質層已不具功能，清除角質可美化皮膚